Who cannot read the informed consent form (e.g. illiteracy, foreigner)

The above is a clinical trial exclusion criterion. Annotated with entity spans:
[Informed_consent: Who cannot read the informed consent form (e.g. illiteracy, foreigner)]